Had change of anti-TNF agent or DMARD in the last 6 months

The above is a clinical trial exclusion criterion. Annotated with entity spans:
Had [Procedure: change] of [Drug: anti-TNF agent] or [Drug: DMARD] [Temporal: in the last 6 months]